兩研究員分別探討吸菸與腦中風的相關性。兩人都得到勝算比（odds ratio）＝2.8 的結果，但是相對應的 95%信賴區間則不同：甲研究員得到（0.9, 8.7），乙研究員為（1.8, 4.4）。請問下列敘述何者最可能正確？
A. 兩者都有統計學上的意義（即 P＜0.05）
B. 吸菸和腦中風沒有相關性
C. 甲研究員的樣本數（sample size）可能比較大
D. 乙研究員的數據變異性（variation）較小

正確答案：D. 乙研究員的數據變異性（variation）較小